有關 Norwood 術式及應用之敘述，下列何者錯誤？
A. 將主肺動脈與主動脈弓下緣吻合，使右心室作全身循環的支持
B. 將心房中隔缺損擴大，以利兩心房之血液混合
C. 使用改良式 Blalock-Taussig 分流術，連接無名動脈至右肺動脈
D. 將主肺動脈環縮（Pulmonary artery banding），以減少肺動脈血流

正確答案：D. 將主肺動脈環縮（Pulmonary artery banding），以減少肺動脈血流